Ante la sospecha de estenosis hipertrófica de píloro ¿cómo iniciaría los exámenes complementarios?.
1. Tránsito digestivo.
2. pHmetría gástrica.
3. Radiología simple.
4. Ecografía.
5. Estudio isotópico.

Respuesta correcta: 4. Ecografía.